一位血小板嚴重缺乏（platelet count 5,000/mm3）的患者，輸與血小板濃集液 24 blood bank units，約 小時後再度驗血，發現血小板數目是 6,000/mm3。下列何者最不可能造成這種現象？
A. bacterial sepsis
B. Immune thrombocytopenic purpura
C. Splenomegaly
D. blood type ABO incompatibility of donated platelets

正確答案：D. blood type ABO incompatibility of donated platelets